La reacción de 1H-indol con electrófilos tiene lugar de forma selectiva sobre el átomo en posición :
1. 1.
2. 2.
3. 3.
4. 4.
5. 5.

Respuesta correcta: 3. 3.